Clinical trial exclusion criterion:
a. History of any significant chronic disease and/or hepatitis. b. History of drug and/or alcohol abuse. c. Acute illness at the time of either the prestudy medical evaluation or dosing.

Annotated entities:
- Parsing_Error: "a."
- Temporal: "History"
- Condition: "chronic disease"
- Condition: "hepatitis"
- Qualifier: "significant"
- Subjective_judgement: "significant"
- Condition: "drug abuse"
- Condition: "alcohol abuse"
- Temporal: "History"
- Undefined_semantics: "Acute illness at the time of either the prestudy medical evaluation or dosing."
- Parsing_Error: "b."
- Parsing_Error: "c."